Clinical trial inclusion criteria:
Confirmed diagnosis (clinical and histological features) of Hailey Hailey or Darier diseases.
Moderate to very severe lesions located in large folds
Patient aged 18 ans or more
Patient with health coverage
Patient who have signed the consent form
Patient proficient into filling out the questionnaires.

Annotated entities:
- Condition: "Hailey Hailey disease"
- Condition: "Darier disease"
- Procedure: "histological"
- Condition: "lesions"
- Context_Error: "lesions"
- Qualifier: "very severe"
- Subjective_judgement: "very severe"
- Undefined_semantics: "very severe"
- Person: "aged"
- Value: "18 ans or more"
- Observation: "health coverage"
- Context_Error: "health coverage"
- Post-eligibility: "Patient who have signed the consent form"
- Context_Error: "Patient who have signed the consent form"
- Non-query-able: "Patient who have signed the consent form"
- Post-eligibility: "Patient proficient into filling out the questionnaires."
- Non-query-able: "Patient proficient into filling out the questionnaires."